primigravida, singleton pregnancy, maternal age 18-35 years, and pregnancy duration 16-20 weeks at the time of study inclusion.

The above is a clinical trial inclusion criterion. Annotated with entity spans:
[Condition: primigravida], [Condition: singleton pregnancy], [Person: maternal age] [Value: 18-35 years], and [Measurement: pregnancy duration] [Value: 16-20 weeks] [Temporal: at the time of study inclusion].